Es un codón de terminación de la traducción:
1. AUG.
2. UAU.
3. UUU.
4. UAC.
5. UAA.

Respuesta correcta: 5. UAA.